評估組織灌流是否足夠，下列何者最為可靠？
A. 血壓
B. 心跳
C. 心搏輸出量（cardiac output）
D. 血中乳酸濃度

正確答案：D. 血中乳酸濃度